人稱戽斗，即下顎較長，係由那一種咬合造成？
A. Angle's class I
B. Angle's class II
C. Angle's class III
D. Overject

正確答案：C. Angle's class III